La ansiedad por separación consta de tres fases. ¿Cuál es su orden?:
1. Protesta, desesperación y negación.
2. Protesta, negación y desesperación.
3. Negación, protesta y desesperación.
4. Desesperación, protesta y negación.

Respuesta correcta: 1. Protesta, desesperación y negación.